Which factors contribute to the risk of very-early-onset inflammatory bowel disease?

Very-early-onset inflammatory bowel disease (VEO-IBD) is a heterogeneous phenotype associated with a spectrum of rare Mendelian disorders including Crohn's disease, depression and cocaine addiction. Somatic mosaicism and common genetic variation contribute to the risk of IBD.